Patients with bilateral age related cataracts, require bilateral cataract phacoemulsification combined Intraocular Lens implantation;

The above is a clinical trial inclusion criterion. Annotated with entity spans:
Patients with [Qualifier: bilateral] [Qualifier: age related] [Condition: cataracts], require [Qualifier: bilateral] [Procedure: cataract phacoemulsification] combined [Procedure: Intraocular Lens implantation];